Male and female subjects aged 20 years or older at informed consent

The above is a clinical trial inclusion criterion. Annotated with entity spans:
[Person: Male] and [Person: female] subjects [Person: aged] [Value: 20 years or older] [Temporal: at informed consent]